美國佛羅里達州 Terry Schiavo 為永久植物人，長期臥床靠鼻胃管進食，她的先生訴請法院拔除其鼻胃管，這關係到何種倫理爭議？
A. 人球
B. 代理孕母
C. 幹細胞
D. 代理決定權

正確答案：D. 代理決定權